Clinical trial inclusion criterion:
elevated levels of NT-proBNP (at least >125 pg/ml)

Annotated entities:
- Measurement: "NT-proBNP"
- Qualifier: "elevated"
- Value: "at least >125 pg/ml"